Clinical trial exclusion criterion:
Need to continue clopidogrel due to stroke, peripheral disease, significant carotid disease or recent acute coronary syndrome

Annotated entities:
- Multiplier: "continue"
- Drug: "clopidogrel"
- Condition: "stroke"
- Condition: "peripheral disease"
- Qualifier: "significant"
- Condition: "carotid disease"
- Temporal: "recent"
- Condition: "acute coronary syndrome"
- Mood: "Need to"